Clinical trial inclusion criteria:
1. Age: 18-75 years old, no limitation in gender;
2. Left ventricular ejection fraction (LVEF) ≤ 40% (ECHO);
3. Patients with chronic heart failure (NYHA class II or III);
4. In the past one month, the clinical condition (including history, clinical symptoms and signs) was relatively stable;
5. Patients on standard treatment of chronic heart failure at the target dose or maximum tolerance dose for over 1 month ,or unchanged dose in last 1 month;
6. Understand and sign the informed consent form;

Annotated entities:
- Value: "18-75 years"
- Person: "Age"
- Measurement: "Left ventricular ejection fraction (LVEF)"
- Value: "≤ 40%"
- Procedure: "ECHO"
- Condition: "chronic heart failure"
- Measurement: "NYHA"
- Value: "class II or III"
- Temporal: "In the past one month"
- Temporal: "history"
- Condition: "clinical symptoms"
- Condition: "clinical signs"
- Qualifier: "relatively stable"
- Condition: "chronic heart failure"
- Procedure: "treatment of chronic heart failure"
- Observation: "maximum tolerance dose"
- Observation: "target dose"
- Temporal: "for over 1 month"
- Temporal: "in last 1 month"
- Observation: "unchanged dose"
- Post-eligibility: "Understand and sign the informed consent form;"
- Non-query-able: "Understand and sign the informed consent form;"